Clinical trial exclusion criterion:
experiences motion sickness in response to driving simulator

Annotated entities:
- Condition: "motion sickness"